Clinical trial exclusion criterion:
Uncontrolled intercurrent or chronic illness

Entity relations:
- OR("intercurrent illness", "chronic illness")